Clinical trial inclusion criterion:
ILD criteria: diagnosis of interstitial lung disease with chronic supplemental oxygen requirement at rest and/or with exertion.

Annotated entities:
- Measurement: "ILD criteria"
- Condition: "interstitial lung disease"
- Observation: "chronic supplemental oxygen requirement"
- Qualifier: "at rest"
- Qualifier: "with exertion"
- Parsing_Error: "and/or"